What was the aim of the HAMLET clinical trial?

The  Hemicraniectomy after middle cerebral artery infarction with life-threatening edema trial  (HAMLET) is a newly-conceived randomised multi-centre clinical trial that compares the efficacy of decompressive surgery to improve functional outcome with that of conservative treatment in patients with space-occupying supratentorial infarction.